18-year or older patients

The above is a clinical trial inclusion criterion. Annotated with entity spans:
[Value: 18-year or older] patients